Clinical trial exclusion criterion:
situation in which the procalcitonin concentration could be increased without correlation to an infectious process (poly-traumatised patients,

Entity relations:
- Has_qualifier("procalcitonin concentration", "increased")